Clinical trial exclusion criterion:
Absolute indication for anti-platelet therapy

Entity relations:
- Has_mood("anti-platelet therapy", "Absolute indication for")